Hemochromatosis

The above is a clinical trial exclusion criterion. Annotated with entity spans:
[Condition: Hemochromatosis]